Subjects with elevated uric acid levels greater than 10 mg/dL or gout

The above is a clinical trial exclusion criterion. Annotated with entity spans:
Subjects with [Value: elevated] [Measurement: uric acid levels] [Value: greater than 10 mg/dL] or [Condition: gout]